一位 14 歲的女孩，兩個星期前被發現兩側肩膀不一樣高，右邊肩胛骨較凸起。她被帶到醫院檢查，確定是右側胸椎青春期原發性脊椎側彎（adolescent idiopathic scoliosis），Cobb's angle 25°，Risser sign 4 。則以下何者是最適當之治療？
A. 觀察
B. 穿著背架
C. 電刺激
D. 手術治 療

正確答案：A. 觀察